no allergy known to these drugs

The above is a clinical trial inclusion criterion. Annotated with entity spans:
[Negation: no] [Condition: allergy] known to [Drug: these drugs]